Blood donation within 60 days prior to screening or intent to donate within 60 days after Final Study Visit.

The above is a clinical trial exclusion criterion. Annotated with entity spans:
[Procedure: Blood donation] [Temporal: within 60 days prior to screening] or [Observation: intent to donate] [Temporal: within 60 days after Final Study Visit].